Clinical trial inclusion criterion:
Adult patients (> 18 years) scheduled for cardiopulmonary bypass surgery with Glomerular Filtration Rate (GFR) greater than or equal to 60 and left ventricular ejection fraction greater than or equal to 40%

Entity relations:
- Has_value("years", "> 18 years")
- Subsumes("Adult", "years")
- Has_value("Glomerular Filtration Rate (GFR)", "greater than or equal to 60")
- Has_value("left ventricular ejection fraction", "greater than or equal to 40%")
- Has_mood("cardiopulmonary bypass surgery", "scheduled for")